Unable to speak Spanish or English

The above is a clinical trial exclusion criterion. Annotated with entity spans:
[Non-query-able: Unable to speak Spanish or English]